Clinical trial inclusion criterion:
1. Justification: Using right-handed individuals will reduce variability in BOLD MRI data.

Annotated entities:
- Parsing_Error: "1."
- Not_a_criteria: "Justification: Using right-handed individuals will reduce variability in BOLD MRI data."